一位 60 歲女性因外陰部搔癢來就診，骨盆腔內診發現外陰皮膚萎縮、變薄、而且變白。則下列何者 為最可能的診斷？
A. 外陰癌（vulvar carcinoma）
B. 外陰上皮內贅瘤（vulvar intraepithelial neoplasia, VIN）
C. 萎縮性外陰炎
D. 硬化性苔癬（lichen sclerosis）

正確答案：D. 硬化性苔癬（lichen sclerosis）